Clinical trial inclusion criterion:
Subject has marked local inflammation

Entity relations:
- Has_qualifier("local inflammation", "marked")